Clinical trial exclusion criterion:
Untreated chronic constipation

Entity relations:
- Has_qualifier("chronic constipation", "Untreated")